Presence of systemic diseases;

The above is a clinical trial exclusion criterion. Annotated with entity spans:
Presence of [Condition: systemic diseases];